Respecto a los malos tratos en la infancia, señale los aspectos que indican el carácter no accidental de lesiones y hacen sospechar que sean debidas a malos tratos:
1. Retraso en pedir ayuda o en acudir a la consulta.
2. Cuando el relato del accidente o de los hechos resulta poco convincente.
3. Las explicaciones que dan los progenitores, por separado son discordantes.
4. Historia con numerosos accidentes o traumatismos.
5. Todas las respuestas recogen situaciones que se asocian al maltrato.

Respuesta correcta: 5. Todas las respuestas recogen situaciones que se asocian al maltrato.